Scheduled to undergo bilateral palatine tonsillectomy as the only procedure

The above is a clinical trial inclusion criterion. Annotated with entity spans:
[Mood: Scheduled to undergo] [Qualifier: bilateral] [Procedure: palatine tonsillectomy] as the [Multiplier: only procedure]